下列有關癌症的遠處效應（remote effects of neoplasm），何者正確？
A. 是癌症轉移（metastasis）產生
B. 有些是因為 IgE 自體免疫抗體造成
C. 只會產生中樞神經病變
D. 肺癌是常見引起該效應的癌症之一

正確答案：D. 肺癌是常見引起該效應的癌症之一